Severe left ventricular hypertrophy (left ventricular septal wall thickness > 13mm)

The above is a clinical trial exclusion criterion. Annotated with entity spans:
[Qualifier: Severe] [Condition: left ventricular hypertrophy] ([Measurement: left ventricular septal wall thickness] [Value: > 13mm])